以生物活性物質（biological response modifiers）例如 Bacille Calmette-Guerin（BCG）增強免疫反應來對抗腫瘤，是屬於：
A. 主動免疫，非抗原特異性
B. 主動免疫，具抗原特異性
C. 被動免疫，非抗原特異性
D. 被動免疫，具抗原特異性

正確答案：A. 主動免疫，非抗原特異性